Clinical trial exclusion criterion:
Current use of either ACE inhibitors or angiotensin II receptor blockers,

Entity relations:
- Has_temporal("ACE inhibitors", "Current use")
- OR("ACE inhibitors", "angiotensin II receptor blockers")